一自然產出生體重 4000 公克的男嬰被發現右上肢活動度不良，經檢視後懷疑有臂神經叢受傷情形， 則下列有關的描述何者有誤？
A. 嬰兒出生時可能有肩難產
B. J 嬰兒可能單側 Moro reflex 增強
C. 嬰兒可能呈現眼瞼低垂
D. 嬰兒可能患側手無法握緊

正確答案：B. J 嬰兒可能單側 Moro reflex 增強